Clinical trial exclusion criterion:
Body mass index (BMI) < 18.5 kg/m2 or > 25 kg/m2.

Entity relations:
- Subsumes("Body mass index", "BMI")
- Has_value("Body mass index", "< 18.5 kg/m2")
- OR("< 18.5 kg/m2", "> 25 kg/m2")